List functional roles of the FtsZ protein.

Four major roles of FtsZ have been characterized: cell elongation, GTPase, cell division, and bacterial cytoskeleton.